Clinical trial inclusion criterion:
18 years of age or older

Annotated entities:
- Person: "age"
- Value: "older 18 years"